25 歲男性咳血並有急速腎功能變壞，病理檢驗發現多數腎小球有新月狀細胞增生（crescentic proliferation）。下列何者表示此病人罹患 Goodpasture syndrome？
A. 腎小球中到處都有免疫複合體沉積
B. 腎小球中無免疫複合體或抗體沉積
C. 腎小球中有 IgG 抗體沉積在基底膜上
D. 腎小球中有補體沉積

正確答案：C. 腎小球中有 IgG 抗體沉積在基底膜上